Malabsorption syndrome or other condition that precludes enteral route of administration

The above is a clinical trial exclusion criterion. Annotated with entity spans:
[Condition: Malabsorption syndrome] or other [Condition: condition that precludes enteral route of administration]